下列何者不是環孢靈（cyclosporine）的藥效？
A. 抑制介白素-2（interleukin-2）
B. 抑制間質纖維化（interstitial fibrosis）
C. 抑制 T 細胞增生（proliferation）
D. 結合免疫細胞內之 immunophilins

正確答案：B. 抑制間質纖維化（interstitial fibrosis）